Clinical trial inclusion criterion:
Foot ulcer at the malleoli area between 0,25 cm² and 5,0 cm²

Annotated entities:
- Condition: "Foot ulcer"
- Qualifier: "malleoli area"
- Value: "between 0,25 cm² and 5,0 cm²"